What condition is usually represented by the acronym SUDEP?

Sudden Unexpected Death in Epilepsy (SUDEP). sudden unexpected death in epilepsy (SUDEP),.